Clinical trial inclusion criterion:
Completion of all vaccinations required by the applicable immunization guidelines published by "ständige Impfkommission" (STIKO)

Annotated entities:
- Non-query-able: "Completion of all vaccinations required by the applicable immunization guidelines published by "ständige Impfkommission" (STIKO)"